一位 60 歲男性肝硬化病人因腹水接受低鹽飲食（＜2 g/day）及利尿劑（spironolactone 400 mg/day 及 furosemide 120 mg/day）治療數週後，腹水仍發展成大量腹水，下列何者為最不適當的處理方式？
A. 可考慮肝臟移植
B. 鼓勵病人多吃高蛋白
C. 大量腹水放液術加白蛋白靜脈注射
D. transjugular intrahepatic portosystemic shunt 只能選擇性應用在適當病人

正確答案：B. 鼓勵病人多吃高蛋白